List characteristics of Developmental and Epileptic Encephalopathies (DEEs).

Developmental and epileptic encephalopathies (DEEs) are the spectrum of severe epilepsies characterized by early-onset, refractory seizures occurring in the context of developmental regression or plateauing, resulting in deterioration in developmental, cognitive, and motor functions.